Clinical trial inclusion criterion:
Lower back pain and/or sciatica with or without spinal claudication.

Annotated entities:
- Condition: "Lower back pain"
- Condition: "sciatica"
- Condition: "spinal claudication"